6. CD4 cell counts >150 cells/μL (though likely most, if not all, will be >250 cells/μL).

The above is a clinical trial inclusion criterion. Annotated with entity spans:
6. [Measurement: CD4 cell counts] [Value: >150 cells/μL] (though likely most, if not all, will be [Value: >250 cells/μL]).